Which method has been developed for mapping of Transcription Start Sites (TSS) starting from nanograms of RNA?

SLIC-CAGE has been developed as a method to identify transcriptome-wide the binding sites of transcription start sites (TSSs) using a simple two-step protocol with 500-50,000 cells and reveals the interplay between genomic locations of DNA-binding sites, transcription, mRNA, and nucleosomes.